Women with PCOS as defined by the Rotterdam criteria.

The above is a clinical trial inclusion criterion. Annotated with entity spans:
[Person: Women] with [Condition: PCOS] as defined by the [Measurement: Rotterdam criteria].